Clinical trial exclusion criterion:
a history of more than two falls in the previous 12 months.

Entity relations:
- Has_multiplier("falls", "more than two")
- Has_temporal("falls", "in the previous 12 months")
- Has_temporal("falls", "history")